Clinical trial exclusion criterion:
pre- operative treatment with anti-emetics, steroids, or analgesics

Annotated entities:
- Drug: "analgesics"
- Drug: "steroids"
- Drug: "anti-emetics"
- Temporal: "pre- operative"
- Procedure: "treatment"